Clinical trial inclusion criterion:
Receive prior treatment including first-line platinum-based chemotherapy, standard second-line chemotherapy and 1 EGF/EGFR inhibitor

Entity relations:
- Has_qualifier("second-line chemotherapy", "standard")
- Subsumes("treatment", "platinum-based chemotherapy")
- OR("platinum-based chemotherapy", "second-line chemotherapy", "1 EGF/EGFR inhibitor")